Pregnancy, lactation.

The above is a clinical trial exclusion criterion. Annotated with entity spans:
[Condition: Pregnancy], [Condition: lactation].